En relación con la clasificación nutricional de los aminoácidos, señale la respuesta correcta:
1. Los aminoácidos esenciales deben sintetizarse endógenamente.
2. La mezcla equilibrada de aminoácidos para una nutrición óptima se consigue más fácilmente con proteínas vegetales que con proteínas animales.
3. Un aminoácido limitante es aquél que no se encuentra en cantidad suficiente en la dieta.
4. Algunos aminoácidos pueden ser esenciales en determinadas enfermedades o situaciones de estrés aunque habitualmente no lo sean.

Respuesta correcta: 4. Algunos aminoácidos pueden ser esenciales en determinadas enfermedades o situaciones de estrés aunque habitualmente no lo sean.